Positive urine drug screen for cannabinoids and other potential abuse substances (e.g. alcohol, cocaine, amphetamines and methamphetamines, unprescribed opioids)

The above is a clinical trial exclusion criterion. Annotated with entity spans:
[Value: Positive] [Measurement: urine drug screen] for [Drug: cannabinoids] and other potential abuse substances (e.g. [Drug: alcohol], [Drug: cocaine], [Drug: amphetamines] and [Drug: methamphetamines], [Qualifier: unprescribed] [Drug: opioids])